Un paciente con Diabetes Mellitus tipo 1, que comienza con fiebre alta debe:
1. Valorar la evolución de la fiebre y esperar.
2. No comer.
3. Valorar la necesidad de aumentar la insulina.
4. Beber abundante agua.
5. No administrase insulina.

Respuesta correcta: 3. Valorar la necesidad de aumentar la insulina.